Alcohol abuse

The above is a clinical trial inclusion criterion. Annotated with entity spans:
[Condition: Alcohol abuse]